Subject has permanent pacemaker or defibrillator implant.

The above is a clinical trial exclusion criterion. Annotated with entity spans:
Subject has [Device: permanent pacemaker] or [Device: defibrillator implant].